Which pathway is activated by ficolin-3?

Ficolin-3 activates lectin complement pathway.